Clinical trial exclusion criterion:
Patient less than age 4 years

Entity relations:
- Has_value("age", "less than 4 years")